Con respecto a la fisostigmina:
1. Es un inhibidor reversible de la acetilcolinesterasa.
2. Es el tratamiento de elección frente a otros derivados sintéticos de la molécula.
3. Se obtiene de hojas de Physostigma venenosum.
4. Es un alcaloide derivado de fenilalanina y tirosina.

Respuesta correcta: 1. Es un inhibidor reversible de la acetilcolinesterasa.